Known allergy/sensitivity or any hypersensitivity to components of study drugs (ART) or their formulations

The above is a clinical trial exclusion criterion. Annotated with entity spans:
Known [Condition: allergy]/[Condition: sensitivity] or any [Condition: hypersensitivity] to [Drug: components of study drugs] ([Drug: ART]) [Drug: or their formulations]